Clinical trial exclusion criterion:
Pregnant or lactating females.

Entity relations:
- AND("females", "Pregnant")
- OR("Pregnant", "lactating")